Clinical trial exclusion criterion:
Platelet count <100g/L;

Entity relations:
- Has_value("Platelet count", "<100g/L")